下列何者發生阻塞而最不會影響臀部的血液供應？
A. 臀上動脈
B. 臀下動脈
C. 陰部內動脈
D. 旋股內側動脈

正確答案：C. 陰部內動脈